Clinical trial inclusion criterion:
Are sensitive to amikacin;

Annotated entities:
- Condition: "sensitive"
- Drug: "amikacin"